進行頸部腫瘤手術時，不幸傷及迷走神經的分枝，最有可能發生情形為何？
A. 胃酸分泌減少
B. 腹瀉
C. 心搏過速
D. 聲音沙啞

正確答案：D. 聲音沙啞